Clinical trial exclusion criterion:
the residual limb must be stable in volume (no change in socket or socket padding in last 6 months) and without pain that limits function

Annotated entities:
- Non-query-able: "the residual limb must be stable in volume (no change in socket or socket padding in last 6 months) and without pain that limits function"